下列何種激素並非由腦下垂體前葉（anterior pituitary）所製造分泌？
A. follicle stimulating hormone
B. prolactin
C. adrenocorticotropic hormone
D. oxytocin

正確答案：D. oxytocin